Clinical trial exclusion criterion:
malignant neoplasm of any location

Entity relations:
- Has_qualifier("neoplasm", "malignant")